Clinical trial exclusion criterion:
Patient not accepting polysomnography and multiple sleep latency test

Entity relations:
- Has_mood("polysomnography", "not accepting")
- Has_mood("multiple sleep latency test", "not accepting")